hypoechoic uterine leiomyoma (echogenicity <3),

The above is a clinical trial inclusion criterion. Annotated with entity spans:
[Qualifier: hypoechoic] [Condition: uterine leiomyoma] ([Measurement: echogenicity] [Value: <3]),